Mujer de 24 años con dos episodios semanales de cefalea de entre uno y tres días de duración, hemicraneal, intensa, acompañada de sono y fotofobia y náuseas. Como tratamiento preventivo NO consideraría uno de estos fármacos:
1. Propranolol.
2. Flunaricina.
3. Carbamacepina.
4. Topiramato.
5. Nadolol.

Respuesta correcta: 3. Carbamacepina.